La exposición a la muerte, sufrir una lesión grave o violencia sexual, ya sea real o percibida como amenaza, es un criterio para el diagnóstico de:
1. Relación social desinhibida.
2. Estrés postraumático.
3. Apego reactivo.
4. Adaptación.

Respuesta correcta: 2. Estrés postraumático.